Clinical trial exclusion criterion:
History or evidence of a stroke

Annotated entities:
- Temporal: "History"
- Mood: "evidence"
- Condition: "stroke"